Las caveolas median procesos de:
1. Exocitosis.
2. Endocitosis.
3. Fagocitosis.
4. Diapédesis.

Respuesta correcta: 2. Endocitosis.